Las cuatro funciones que integran el rol de la enfermera en el modelo de Hildegarde Peplau son:
1. Función de desconocida, función de conocida, función de persona-recurso, función de sustituta.
2. Función de desconocida, función de conocida, función de sustituta, función de consejera-orientadora.
3. Función de desconocida, función de personarecurso, función de sustituta, función de consejera-orientadora.
4. Función de desconocida, función de personarecurso, función de conocida, función de consejera.

Respuesta correcta: 3. Función de desconocida, función de personarecurso, función de sustituta, función de consejera-orientadora.